In which condition was protein S100A7 originally identified?

Psoriasin (S100A7) was originally identified in psoriasis.